(3) If you have sexual intercourse with only one male partner who has been confirmed to have no semen after fertilization.

The above is a clinical trial exclusion criterion. Annotated with entity spans:
(3) [Pregnancy_considerations: If you have sexual intercourse with only one male partner who has been confirmed to have no semen after fertilization.]